The Mantoux test detects what latent infection/disease?

screened for TB infection with a Mantoux tuberculin skin testtuberculin skin test (TST) performed according to the Mantoux method.